髖關節置換手術後 3 個月內應該避免的動作不包括下列何者？
A. 屈曲（flexion）90 度以上
B. 外展（abduction）
C. 內收（adduction）
D. 內轉（internal rotation）

正確答案：B. 外展（abduction）